一群無肝病過去史之大學生欲至未開發地區旅遊，家長們擔心他們會感染肝炎，要求行前給予預防注射。以下各項中最不正確的預防注射為：
A. 血清免疫球蛋白（immune serum globulin）
B. A 型肝炎疫苗
C. B 型肝炎疫苗
D. HBV DNA（hepatitis B virus DNA）

正確答案：D. HBV DNA（hepatitis B virus DNA）